Clinical trial exclusion criterion:
Pregnancy, coagulopathy, allergy to bupivacaine, renal failure, hepatic insufficiency, and/or inappropriate candidate for usual therapy (specifically, if unable to receive the usual preoperative interscalene nerve block: preexisting nerve injury on side of surgery, refusal of nerve block, infection at site of nerve block).

Entity relations:
- AND("allergy", "bupivacaine")
- AND("inappropriate candidate", "usual therapy")
- Has_mood("preoperative interscalene nerve block", "unable to receive")
- Has_qualifier("infection", "site of nerve block")
- Has_qualifier("nerve injury", "side of surgery")
- Has_temporal("nerve injury", "preexisting")
- AND("preoperative interscalene nerve block", "nerve injury")
- Subsumes("inappropriate candidate", "nerve injury")
- OR("refusal of nerve block", "infection")
- OR("Pregnancy", "coagulopathy", "allergy", "renal failure", "hepatic insufficiency", "inappropriate candidate")